Clinical trial exclusion criterion:
Contraindications to MRI scanning including cardiac pacemaker, metallic objects and metallic implants contraindicating MRI, cardiac stent, claustrophobia;

Annotated entities:
- Condition: "Contraindications"
- Procedure: "MRI"
- Device: "cardiac pacemaker"
- Device: "metallic objects"
- Device: "metallic implants"
- Device: "cardiac stent"
- Condition: "claustrophobia"